Have an Axis I diagnosis of Schizophrenia, Schizoaffective Disorder, Schizophreniform Disorder or Bipolar I Disorder as diagnosed by the Structured Clinical Interview for DSM-IV Axis I Disorders (SCID-I), and pertinent subsequent for ruling out exclusionary diagnoses.

The above is a clinical trial exclusion criterion. Annotated with entity spans:
Have an Axis I diagnosis of [Condition: Schizophrenia], [Condition: Schizoaffective Disorder], [Condition: Schizophreniform Disorder] or [Condition: Bipolar I Disorder] as diagnosed by the [Procedure: Structured Clinical Interview for DSM-IV Axis I Disorders (SCID-I)], and pertinent subsequent for ruling out exclusionary diagnoses.